Clinical trial inclusion criterion:
Elective open abdominal hysterectomy with midline incision, age > 18 years, American Society of Anesthesiologist classification score (ASA classification) 1-3.

Entity relations:
- Has_qualifier("open abdominal hysterectomy", "Elective")
- Has_qualifier("open abdominal hysterectomy", "midline incision")
- Has_value("age", "> 18 years")
- Subsumes("American Society of Anesthesiologist classification score", "ASA classification")
- Has_value("American Society of Anesthesiologist classification score", "1-3")